Unable to participate for administrative reasons

The above is a clinical trial exclusion criterion. Annotated with entity spans:
[Observation: Unable to participate] for [Qualifier: administrative reasons]